Clinical trial inclusion criterion:
3. Agree to daily application of gel and monitoring as per Daily Monitored Adherence (DMA) method

Entity relations:
- Has_multiplier("gel", "daily")
- Has_multiplier("monitoring", "daily")